Significant metabolic and endocrine diseases.

The above is a clinical trial exclusion criterion. Annotated with entity spans:
Significant [Condition: metabolic] and [Condition: endocrine diseases].